Pterygium, pinguecula, or corneal scars within the visual axis

The above is a clinical trial exclusion criterion. Annotated with entity spans:
[Condition: Pterygium], [Condition: pinguecula], or [Condition: corneal scars] [Qualifier: within the visual axis]